5. Primary sclerosing cholangitis

The above is a clinical trial exclusion criterion. Annotated with entity spans:
[Parsing_Error: 5.] [Condition: Primary sclerosing cholangitis]